下列何者匯入乳糜池（cisterna chyli）？ ①腸淋巴幹（intestinal lymphatic trunk） ②左腰淋巴幹（left  lumbar lymphatic trunk） ③右腰淋巴幹（right lumbar lymphatic trunk）
A. 僅①
B. 僅①②
C. 僅①③
D. ①②③

正確答案：D. ①②③